Patients suffering from chronic heart failure (the heart failure diagnosis must have been made or confirmed by a cardiologist and/or hospital physician at any time in the patient's medical history).

The above is a clinical trial inclusion criterion. Annotated with entity spans:
Patients suffering from [Condition: chronic heart failure] (the heart failure diagnosis must have been made or confirmed by a cardiologist and/or hospital physician at any time in the patient's medical history).